Pinhole visual acuity worse than 20/200 in the unaffected eye

The above is a clinical trial exclusion criterion. Annotated with entity spans:
[Measurement: Pinhole visual acuity] [Value: worse than 20/200] in the unaffected eye